Clinical trial inclusion criterion:
Capable of providing written informed consent

Entity relations:
- OR("Capable of providing written informed consent", "written informed consent")